Clinical trial inclusion criterion:
HbA1c = 5.7%

Annotated entities:
- Measurement: "HbA1c"
- Value: "= 5.7%"